下列何種腦下腺前葉激素最有可能作用於全身細胞或組織？
A. 生長激素（growth hormone）
B. 雌激素（estrogen）
C. 助孕酮（progesterone）
D. 催產素（oxytocin）

正確答案：A. 生長激素（growth hormone）